有關膀胱儲存尿液的敘述，下列何者錯誤？
A. 陰部神經控制外括約肌收縮
B. 交感神經控制膀胱頸平滑肌收縮
C. 副交感神經抑制膀胱體收縮
D. 維持膀胱在一穩定低壓力狀態

正確答案：C. 副交感神經抑制膀胱體收縮